藥物 adalimumab（Humira）為目前治療類風濕性關節炎之有效生物製劑。其主要之作用機轉為抑制下列那一種細胞激素之作用？
A. tumor necrosis factor-α
B. interferon-α
C. interleukin-2
D. interleukin-1

正確答案：A. tumor necrosis factor-α